一位 5 歲男童兩天前開始有發燒的現象，今日開始有小腿後方的肌肉疼痛，抽血檢驗顯示血中白血球數為 12,000/mm3（中性球 55%，淋巴球 38%，單核球 7%）；血紅素（hemoglobin）值為 11.6 g/dL；血小板數為 360,000/mm3；血中鉀離子濃度為 4.0 mmol/L，鈉離子濃度為 135 mmol/L，血中 ALT 48 U/L，
 U/L，LDH 677 U/L，CK 1502 U/L，尿液檢查顯示 OB 3+，RBC 1～3/HPF，尿蛋白：negative。男童最有可能的診斷為：
A. 急性肝炎（acute hepatitis）
B. 急性溶血症（acute hemolytic syndrome）
C. 急性橫紋肌溶解症（acute rhabdomyolysis）
D. 急性膀胱炎（acute cystitis）

正確答案：C. 急性橫紋肌溶解症（acute rhabdomyolysis）